El primer nivel de control de la frecuencia cardiaca y respiratoria es:
1. La corteza cerebral.
2. La médula espinal.
3. El cerebelo.
4. El bulbo.
5. El hipotálamo.

Respuesta correcta: 4. El bulbo.